有關天疱瘡（pemphigus）的敘述，下列何者錯誤？
A. Pemphigus患者常在冬季或因工作壓力大，服用藥物或是病毒感染等等因素惡化
B. 含有sulfhydryl groups (-S-H) 藥物會與角質細胞的cystein結合，改變角質細胞鍵結強度，形成天疱瘡
C. Thiols類藥物可誘發抗desmoglein 1 和抗desmoglein 3抗體, 形成天疱瘡
D. Drug-induced pemphigus患者的預後與一般pemphigus無異

正確答案：D. Drug-induced pemphigus患者的預後與一般pemphigus無異